Clinical trial exclusion criterion:
Estimated Glomerular Filtration Rate (eGFR) < 30 ml/min

Entity relations:
- Has_value("Estimated Glomerular Filtration Rate (eGFR)", "< 30 ml/min")